Clinical trial inclusion criterion:
patient hospitalized in critical care units

Entity relations:
- AND("hospitalized", "critical care units")